Clinical trial exclusion criterion:
Exposure to more than 4 investigational medicinal products within 12 months prior to the first dosing day.

Entity relations:
- Has_index("within 12 months prior to the first dosing day", "the first dosing day")
- Has_temporal("investigational medicinal products", "within 12 months prior to the first dosing day")
- Has_multiplier("investigational medicinal products", "more than 4")